某醫院耳鼻喉科陳醫師從事臨床研究時，為了方便，手術中順便採集病人血液並留存病人檢體作為爾後實驗分析使用，他的病人並不知道此一狀況，該研究投稿時，期刊主編要求陳醫師提出病人知情同意的證明，陳醫師遲遲未能提出，請問陳醫師違反了那一個國際宣言的規範？
A. 日內瓦宣言
B. 赫爾辛基宣言
C. 東京宣言
D. 華盛頓宣言

正確答案：B. 赫爾辛基宣言